Clinical trial inclusion criterion:
A male or female aged 61 years or above at the time of the first vaccination.

Entity relations:
- Has_value("aged", "61 years or above")
- OR("male", "female")